下列何者不屬於Smilkstein所創立出來的家庭APGAR功能問卷之五個成分？
A. 適應度（adaptation）
B. 合作度（partnership）
C. 成長度（growth）
D. 資源度（resource）

正確答案：D. 資源度（resource）